Clinical trial exclusion criterion:
Esophageal stenosis preventing the passage of an endoscope,

Annotated entities:
- Condition: "Esophageal stenosis"
- Mood: "preventing the"
- Device: "endoscope"
- Procedure: "passage of an endoscope"